Clinical trial inclusion criterion:
Pulmonary disease

Annotated entities:
- Condition: "Pulmonary disease"